Clinical trial inclusion criterion:
All adult patients 18 years of age or older admitted to the intensive care units of St. Boniface General Hospital with a diagnosis of acute pulmonary blastomycosis requiring mechanical ventilation.

Entity relations:
- Has_value("age", "18 years or older")
- AND("admitted", "intensive care units")
- AND("acute pulmonary blastomycosis", "mechanical ventilation")
- AND("admitted", "St. Boniface General Hospital")